Clinical trial exclusion criterion:
History of renal calculi

Annotated entities:
- Condition: "renal calculi"
- Temporal: "History"